Clinical trial inclusion criterion:
Females must not be pregnant and must have a negative serum pregnancy test result at the Screening Visit and Day -1.

Annotated entities:
- Condition: "pregnant"
- Negation: "not"
- Person: "Females"
- Measurement: "serum pregnancy test"
- Value: "negative"
- Temporal: "at the Screening Visit and Day -1"
- Reference_point: "the Screening Visit and Day -1"
- Post-eligibility: "Females must not be pregnant and must have a negative serum pregnancy test result at the Screening Visit and Day -1."